在A、B兩種未知的細菌雙股DNA中，我們測得其胸腺嘧啶（thymidine）的成分分別占了16%與31%，下列敘述何者錯誤？
A. A細菌的腺嘌呤（adenosine）約占其DNA組成的16%
B. A細菌的胞嘧啶（cytosine）約占其DNA組成的34%
C. B細菌的胞嘧啶（cytosine）約占其DNA組成的31%
D. 推測A細菌比B細菌更有可能是在高溫溫泉地生存

正確答案：C. B細菌的胞嘧啶（cytosine）約占其DNA組成的31%